Clinical trial exclusion criterion:
adequately controlled with appropriate therapy or would compromise the patient's ability to tolerate this therapy; 2. Treatment with any systemic anticancer therapy ≤ 3 weeks prior to cycle 1 day 1 3. Uncontrolled active infection (Hepatitis B and C infection are NOT exclusion criteria) and/or known HIV infection; 4. Renal failure requiring haemodialysis or peritoneal dialysis; 5. Patients who are pregnant or breast-feeding; 6. Patients with significantly diseased or obstructed gastrointestinal tract, malabsorption, uncontrolled vomiting or diarrhea resulting in inability to swallow oral medications; 7. Presence of symptomatic CNS metastasis 8. Unresolved toxicity from previous anti-cancer therapy or incomplete recovery from surgery, in particular oxaliplatin-induced peripheral neuropathy > grade 1.

Annotated entities:
- Subjective_judgement: "adequately controlled with appropriate therapy or would compromise the patient's ability to tolerate this therapy; 2."
- Non-query-able: "adequately controlled with appropriate therapy or would compromise the patient's ability to tolerate this therapy; 2."
- Procedure: "systemic anticancer therapy"
- Temporal: "≤ 3 weeks prior to cycle 1"
- Reference_point: "cycle 1"
- Condition: "Hepatitis B infection"
- Condition: "Hepatitis C infection"
- Negation: "NOT"
- Condition: "infection"
- Temporal: "active"
- Qualifier: "Uncontrolled"
- Condition: "HIV infection"
- Condition: "Renal failure"
- Procedure: "haemodialysis"
- Procedure: "peritoneal dialysis"
- Condition: "pregnant"
- Condition: "breast-feeding"
- Parsing_Error: "6."
- Parsing_Error: "5."
- Condition: "obstructed gastrointestinal tract"
- Condition: "diseased gastrointestinal tract"
- Undefined_semantics: "diseased gastrointestinal tract"
- Qualifier: "significantly"
- Subjective_judgement: "significantly"
- Non-query-able: "significantly"
- Condition: "malabsorption"
- Condition: "vomiting"
- Qualifier: "uncontrolled"
- Condition: "diarrhea"
- Condition: "inability to swallow oral medications"
- Parsing_Error: "7."
- Condition: "CNS metastasis"
- Parsing_Error: "8."
- Qualifier: "symptomatic"
- Procedure: "anti-cancer therapy"
- Temporal: "previous"
- Procedure: "surgery"
- Condition: "incomplete recovery"
- Drug: "oxaliplatin"
- Qualifier: "oxaliplatin-induced"
- Condition: "peripheral neuropathy"
- Condition: "Unresolved toxicity"